Clinical trial inclusion criterion:
Cruciate ligament of the knee reconstructive surgery

Entity relations:
- Has_qualifier("reconstructive surgery", "Cruciate ligament of the knee")